Clinical trial inclusion criterion:
Time from onset to treatment =6 hours;

Annotated entities:
- Observation: "Time from onset to treatment"
- Value: "=6 hours"